Clinical trial inclusion criterion:
Patient with a high or very high cardiovascular risk treated by lipidlowering therapy with statin

Annotated entities:
- Qualifier: "very high"
- Qualifier: "high"
- Condition: "cardiovascular risk"
- Procedure: "lipidlowering therapy"
- Drug: "stati"